Current pregnancy as assessed by preoperative urine HCG test

The above is a clinical trial exclusion criterion. Annotated with entity spans:
Current [Value: pregnancy] as assessed by [Temporal: preoperative] [Measurement: urine HCG test]